下列對於體內痛覺調控（pain modulation）之敘述，何者錯誤？
A. 可以發生在 nociceptors, spinal cord 或 supraspinal 之組織
B. 有抑制性或興奮性之調控方式
C. 活化 N-methyl-D-aspartate（NMDA）受體和抑制性調控機制有關
D. 活化 NK-1 受體和興奮性調控機制有關

正確答案：C. 活化 N-methyl-D-aspartate（NMDA）受體和抑制性調控機制有關